Cuál de las siguientes membranas sería más fluida:
1. Bicapa de lípidos con ácidos grasos poliinsaturados de 18 átomos de carbono.
2. Bicapa de lípidos con ácidos grasos saturados de 18 átomos de carbono.
3. Bicapa de lípidos con ácidos grasos saturados de 16 átomos de carbono.
4. Bicapa de lípidos con ácidos grasos poliinsaturados de 16 átomos de carbono.
5. Todas son equivalentes en cuanto a fluidez.

Respuesta correcta: 4. Bicapa de lípidos con ácidos grasos poliinsaturados de 16 átomos de carbono.